Clinical trial exclusion criterion:
Scheduled major surgery in the next 6 months;

Entity relations:
- Has_temporal("major surgery", "in the next 6 months")
- Has_mood("major surgery", "Scheduled")